Clinical trial exclusion criterion:
22. Clinically unacceptable result at the screening physical examination

Entity relations:
- Has_index("at the screening physical examination", "the screening physical examination")
- AND("the screening physical examination", "physical examination")
- Has_qualifier("Clinically unacceptable result", "Clinically unacceptable")